Has chronic back pain of =3 months duration by history

The above is a clinical trial inclusion criterion. Annotated with entity spans:
Has [Condition: chronic back pain] of [Qualifier: =3 months duration] by [Temporal: history]